How can B-cells transdifferentiate into macrophages?

Through the ectopic over-expression of the CCAAT/enhancer binding protein-α (C/EBPα), which induces transdifferentiation of B cells into macrophages at high efficiencies.